Myocardial infarction

The above is a clinical trial exclusion criterion. Annotated with entity spans:
[Condition: Myocardial infarction]